Clinical trial exclusion criterion:
5. Pregnancy or breastfeeding

Annotated entities:
- Parsing_Error: "5."
- Condition: "Pregnancy"
- Observation: "breastfeeding"